School districts that are too difficult to reach (more than a 3-hour walk from the farthest place reachable by a four-wheel drive vehicle)

The above is a clinical trial exclusion criterion. Annotated with entity spans:
[Visit: School districts that are too difficult to reach] ([Value: more than a 3-hour] [Measurement: walk from the farthest place reachable by a four-wheel drive vehicle])